女性之小陰唇係由下列何者衍生而成？
A. 尿道褶（urethral fold）
B. 生殖結節（genital tubercle）
C. 生殖隆起（genital swelling）
D. 肛門褶（anal fold）

正確答案：A. 尿道褶（urethral fold）